regnant women

The above is a clinical trial exclusion criterion. Annotated with entity spans:
[Condition: regnant] [Person: women]